Clinical trial inclusion criterion:
Female subjects between 16 and 40 years or women older than 40 years with a cessation of ovarian function before the age of 40 years with increased levels of FSH

Entity relations:
- Has_value("years", "between 16 and 40 years")
- Has_index("older than 40 years", "older")
- AND("Female", "years")
- Has_value("women", "older than 40 years")
- Has_value("age", "before the age of 40 years")
- Has_value("levels of FSH", "increased")
- AND("cessation of ovarian function", "age")
- AND("women", "cessation of ovarian function")
- AND("cessation of ovarian function", "levels of FSH")
- OR("Female", "women")